Clinical trial exclusion criterion:
Patients who received corticosteroids in the last 6 weeks.

Annotated entities:
- Drug: "corticosteroids"
- Temporal: "in the last 6 weeks"